Señale cuál de los siguientes NO es un modo de ayuda propuesto en la Teoría de los Sistemas de Enfermería de D. Orem:
1. Enseñar.
2. Proporcionar un entorno familiar que promueva el desarrollo.
3. Proporcionar soporte físico o psicológico.
4. Guiar y dirigir.

Respuesta correcta: 2. Proporcionar un entorno familiar que promueva el desarrollo.